Clinical trial exclusion criterion:
Glomerular filtration rate <30mL/minute or on dialysis

Annotated entities:
- Measurement: "Glomerular filtration rate"
- Value: "<30mL/minute"
- Procedure: "dialysis"